Which class of genes are mutated in Diamond Blackfan Anemia patients?

Diamond Blackfan anemia (DBA) is an inherited erythroblastopenia associated with mutations in at least 8 different ribosomal protein genes.